Received heart transplantation or pacemaker implantation; revascularization treatment within 3 months; or plan to receive above treatment in 6 months.

The above is a clinical trial exclusion criterion. Annotated with entity spans:
Received [Procedure: heart transplantation] or [Procedure: pacemaker implantation]; [Procedure: revascularization] treatment [Temporal: within 3 months]; or [Mood: plan to] receive above treatment [Temporal: in 6 months].